Agree to not seek additional treatment, apart from Alcoholics Anonymous

The above is a clinical trial inclusion criterion. Annotated with entity spans:
[Non-representable: Agree to not seek additional treatment, apart from Alcoholics Anonymous]